After half-dose ticagrelor (loading dose 90mg, and then 45mg bidpo.) treatment for 3 days, the platelet aggregation is effectively inhibited by light transmission aggregometry method and thromboela-stogram.

The above is a clinical trial inclusion criterion. Annotated with entity spans:
After [Multiplier: half-dose] [Drug: ticagrelor] ([Measurement: loading dose] [Value: 90mg], and then [Multiplier: 45mg bidpo.]) [Temporal: treatment for 3 days], the [Measurement: platelet aggregation] is [Qualifier: effectively] [Value: inhibited] by [Procedure: light transmission aggregometry] method and [Procedure: thromboela-stogram].